當懷疑眼球破裂時，下列處置何者錯誤？
A. 量眼球壓力（IOP）
B. 用金屬眼罩保護
C. 照 X-ray，例如 Water's view 或眼球 CT
D. 靜脈注射 cephalosporine

正確答案：A. 量眼球壓力（IOP）